First presentation of AIH requiring treatment according to the current EASL guidelines

The above is a clinical trial inclusion criterion. Annotated with entity spans:
First presentation of [Condition: AIH] requiring [Procedure: treatment] according to the current [Measurement: EASL guidelines]